History of malignancy with chemotherapy

The above is a clinical trial exclusion criterion. Annotated with entity spans:
History of [Condition: malignancy] with [Procedure: chemotherapy]